Which are the consequences of the hyperphosphorylated tau in Alzheimers' Disease?

The consequences of the hyperphosphorylated tau in Alzheimers' Disease is:
1) The formation of neurofibrillary tangles (NFTs)
2) Impaired glutamate metabolism
3) Decreased tau affinity for microtubules binding
4) Dendritic and axonal instability
5) Synaptic degeneration
6) Neuronal loss.